La reacción de ciclopenteno con una disolución acuosa de bromo a 0 ºC origina:
1. trans-1,2-dibromociclopentano.
2. cis-2-bromociclopentanol.
3. trans -2-bromociclopentanol.
4. trans -1,2-ciclopentanodiol.
5. cis-1,2- dibromociclopentano.

Respuesta correcta: 3. trans -2-bromociclopentanol.